Clinical trial exclusion criterion:
Ongoing allergen immunotherapy

Annotated entities:
- Procedure: "allergen immunotherapy"